有關pulsus alternans之敘述，下列何者正確？
A. 一般而言，皆與心電圖記錄的electrical alternans同時出現
B. 在嚴重左心衰竭病人身上出現時，代表心臟收縮力每次心跳之間有差異
C. 常出現在清晨時
D. 常出現在肺高壓合併右心衰竭的病人

正確答案：B. 在嚴重左心衰竭病人身上出現時，代表心臟收縮力每次心跳之間有差異